乙狀結腸（sigmoid colon）的靜脈匯入下列何者？
A. 下腸繫膜靜脈（inferior mesenteric vein）
B. 上腸繫膜靜脈（superior mesenteric vein）
C. 門靜脈（portal vein）
D. 脾靜脈（splenic vein）

正確答案：A. 下腸繫膜靜脈（inferior mesenteric vein）